下列何種藥物不需給早期急性冠心病病人服用？
A. Statin
B. Anti-platelet agent
C. ACE inhibitor
D. hormone replacement therapy

正確答案：D. hormone replacement therapy